What happens upon disruption of a TAD boundary?

both in mouse limb tissue and patient-derived fibroblasts, disease-relevant structural changes cause ectopic interactions between promoters and non-coding dna, and a cluster of limb enhancers normally associated with epha4 is misplaced relative to tad boundaries and drives ectopic limb expression of another gene in the locus.